Clinical trial exclusion criterion:
Active malignancy

Entity relations:
- Has_qualifier("malignancy", "Active")